Proteins in the karyopherin family (Kaps) are associated with what cellular process?

Nuclear translocation of large proteins is mediated through specific protein carriers, collectively named karyopherins (importins, exportins and adaptor proteins)